Clinical trial exclusion criterion:
a history of arrhythmia, bronchial and cardiovascular diseases, abnormal liver function and so on

Entity relations:
- Has_temporal("arrhythmia", "history")
- OR("arrhythmia", "bronchial diseases", "cardiovascular diseases", "abnormal liver function")